Impaired liver function (ALT > 120 U/L)

The above is a clinical trial exclusion criterion. Annotated with entity spans:
[Condition: Impaired liver function] ([Measurement: ALT] [Value: > 120 U/L])